Clinical trial inclusion criterion:
Elderly patients over 65 years old exhibiting clinical indices of cardiovascular disease

Entity relations:
- Has_value("old", "over 65 years")
- Subsumes("Elderly", "old")